中年女性病人，主訴倦怠、茶色尿及皮膚搔癢約半年求診。理學檢查發現輕度鞏膜黃疸。腹部超音波檢查顯示慢性肝炎影像。血液檢驗數據：bilirubin T/D 4.3/2.1（0.2-1.2/0.0-0.4）mg/dL；Alk-P 560 （66-240）IU/L；cholesterol 375（130-200）mg/dL；IgM 870（45-250）mg/dL；antimitochondrial antibody
A. PSC（primary sclerosing cholangitis）
B. PBC（primary biliary cirrhosis）
C. hereditary hemochromatosis
D. Wilson's disease

正確答案：B. PBC（primary biliary cirrhosis）